Level I or level II on the American Society of Anesthesiologists (ASA) physical status classification system (as determined by the anesthesiologist)

The above is a clinical trial inclusion criterion. Annotated with entity spans:
[Value: Level I or level II] on the [Measurement: American Society of Anesthesiologists (ASA) physical status] classification system (as determined by the anesthesiologist)